Según el modelo reformulado de indefensión aprendida ¿Cómo son las atribuciones que hace una persona con depresión para un acontecimiento negativo incontrolable?:
1. Internas, estables y específicas.
2. Internas, estables y globales.
3. Externas, estables y globales.
4. Externas, estables y específicas.

Respuesta correcta: 2. Internas, estables y globales.